①小腦  ②內耳 ③腦幹等三個構造中，何者受損可能造成暈眩（vertigo）？
A. 僅①②
B. 僅②③
C. 僅②
D. ①②③

正確答案：D. ①②③